Clinical trial inclusion criteria:
18 years of age and older,
diagnosis of stage II adhesive capsulitis as determined by clinical examination of the treating physician, and
absence of abnormal findings on X-ray.

Annotated entities:
- Value: "18 years and older"
- Person: "age"
- Qualifier: "stage II"
- Condition: "adhesive capsulitis"
- Qualifier: "as determined by clinical examination"
- Procedure: "clinical examination"
- Negation: "absence of"
- Condition: "abnormal findings"
- Procedure: "X-ray"